Clinical trial exclusion criterion:
Decompensated heart failure

Annotated entities:
- Condition: "Decompensated heart failure"